Indwelling continuous thoracic epidural analgesia

The above is a clinical trial exclusion criterion. Annotated with entity spans:
[Qualifier: Indwelling] [Qualifier: continuous] [Procedure: thoracic epidural analgesia]